En el examen sistemático a una embarazada a término (37 semanas de gestación), se aíslan a partir de un frotis vaginal colonias betahemolíticas que son identificadas como Streptococcus agalactiae.¿Qué valoración haría de dicho hallazgo y cuál sería la actitud terapéutica más recomendable a seguir?
1. No tiene importancia ya que forma parte de la microbiota comensal de la vagina.
2. Se recomienda nacimiento mediante cesárea.
3. No está indicada la búsqueda de Streptococcus agalactiae en la embarazada.
4. Tratamiento antibiótico inmediato al recién nacido.
5. Administrar profilaxis antibiótica intravenosa durante el parto a la embarazada.

Respuesta correcta: 5. Administrar profilaxis antibiótica intravenosa durante el parto a la embarazada.